2. Contraindication or allergy to paracetamol or artesunate therapy

The above is a clinical trial exclusion criterion. Annotated with entity spans:
[Parsing_Error: 2.] [Condition: Contraindication] or [Condition: allergy] to [Drug: paracetamol] or [Drug: artesunate] therapy